Patients who have had influenza vaccine in two of the three previous years

The above is a clinical trial exclusion criterion. Annotated with entity spans:
Patients who have had [Drug: influenza vaccine] [Temporal: in two of the three previous years]